Clinical trial inclusion criterion:
Histological evidence: FL Grade 1-3A/iNHL, with relapsed or refractory disease (iNHL includes LPL/WM, MZL); aNHL, defined as DLBCL, FL Grade 3B, MCL, and transformed NHL with relapsed disease; CLL/SLL, PTCL, or CTCL (with MF/SS) with relapsed or refractory.

Entity relations:
- Has_value("Grade", "1-3A")
- AND("FL", "Grade")
- Subsumes("iNHL", "LPL")
- Subsumes("relapsed disease", "iNHL")
- Has_value("Grade", "3B")
- AND("CTCL", "MF")
- AND("transformed NHL", "relapsed disease")
- Subsumes("aNHL", "DLBCL")
- OR("FL", "iNHL")
- OR("relapsed disease", "refractory disease")
- OR("LPL", "WM", "MZL")
- OR("MF", "SS")
- OR("DLBCL", "transformed NHL", "Grade", "FL", "MCL")
- OR("iNHL", "CLL", "SLL", "PTCL", "CTCL", "aNHL")